Clinical trial exclusion criterion:
Planned hospitalization during the study period, for any diagnostic or treatment procedures.

Entity relations:
- Has_temporal("hospitalization", "during the study period")
- Has_mood("hospitalization", "Planned")
- AND("hospitalization", "diagnostic procedures")
- OR("diagnostic procedures", "treatment procedures")